Clinical trial inclusion criterion:
2. Healthy subjects aged between 18 years and 45 years inclusive

Entity relations:
- Has_value("aged", "between 18 years and 45 years inclusive")